The patient's data will be excluded if they die within 3 days of hospital admission.

The above is a clinical trial exclusion criterion. Annotated with entity spans:
The patient's data will be excluded if they [Observation: die] [Temporal: within 3 days of hospital admission].